Clinical trial exclusion criterion:
Person who is not able to walk on level ground in a step over step manner.

Annotated entities:
- Non-query-able: "Person who is not able to walk on level ground in a step over step manner"